Newborns with severe congenital anomalies

The above is a clinical trial exclusion criterion. Annotated with entity spans:
[Person: Newborns] with [Condition: severe congenital anomalies]